Clinical trial exclusion criterion:
Currently responding to medication treatment, without clinical reasons to change.

Annotated entities:
- Non-query-able: "Currently responding to medication treatment, without clinical reasons to change"